Clinical trial exclusion criterion:
Any metabolic disorders or other diseases that may impact on normal growth patterns.

Entity relations:
- Has_qualifier("metabolic disorders", "may impact on normal growth patterns")
- OR("metabolic disorders", "other diseases")